Clinical trial inclusion criterion:
Diagnosed with head and neck cancer and treated for a period of up to 5 years with radiotherapy where the major salivary glands (parotid, submandibular and sublingual) were included in the radiation field;

Entity relations:
- Has_temporal("head and neck cancer", "5 years")
- Subsumes("major salivary glands", "parotid")
- Has_qualifier("radiotherapy", "major salivary glands")
- AND("head and neck cancer", "radiotherapy")
- Subsumes("major salivary glands", "submandibular")
- Subsumes("major salivary glands", "sublingual")